Clinical trial inclusion criterion:
Recent catheter insertion at beginning of the study.

Annotated entities:
- Procedure: "catheter insertion"
- Temporal: "at beginning of the study"
- Temporal: "Recent"
- Reference_point: "beginning of the study"